Pregnant and/or nursing mothers.

The above is a clinical trial exclusion criterion. Annotated with entity spans:
[Condition: Pregnant] and/or [Condition: nursing] mothers.